Los termopares se utilizan como:
1. Detectores de radiación ultravioleta basados en el efecto fotoeléctrico.
2. Detectores de radiación infrarroja de fotoconductores.
3. Detectores de rayos X basados en la resistencia.
4. Detectores de radiación infrarroja basada en la temperatura.

Respuesta correcta: 4. Detectores de radiación infrarroja basada en la temperatura.